Age >18 years old

The above is a clinical trial inclusion criterion. Annotated with entity spans:
[Person: Age] [Value: >18 years old]